Clinical trial exclusion criterion:
1. Presence of other neoplasia

Annotated entities:
- Parsing_Error: "1."
- Condition: "neoplasia"
- Qualifier: "other"